Clinical trial exclusion criterion:
Total bilirubin > 2 x ULN

Entity relations:
- Has_value("Total bilirubin", "> 2 x ULN")